Clinical trial inclusion criterion:
Maternal or infant urine drug screen positive for methadone and/or opioids on admission

Annotated entities:
- Qualifier: "Maternal"
- Qualifier: "infant"
- Measurement: "urine drug screen"
- Value: "positive"
- Qualifier: "methadone"
- Qualifier: "opioids"